(1)= 45 years old;

The above is a clinical trial inclusion criterion. Annotated with entity spans:
(1)[Value: = 45 years] [Person: old];